Clinical trial inclusion criterion:
Signed consent form

Annotated entities:
- Non-query-able: "Signed consent form"